Ages=65 years,Not limited to gender.

The above is a clinical trial inclusion criterion. Annotated with entity spans:
[Person: Ages][Value: =65 years],Not limited to gender.